Uncorrected hypokalemia or hyperkalemia (potassium <3.5 mmol/l or >5.5 mmol/l).

The above is a clinical trial exclusion criterion. Annotated with entity spans:
Uncorrected [Condition: hypokalemia] or [Condition: hyperkalemia] ([Measurement: potassium] [Value: <3.5 mmol/l] or [Value: >5.5 mmol/l]).